腮腺（parotid gland）之分泌訊號藉由何神經傳遞？
A. 面神經（facial nerve）
B. 上頜神經（maxillary nerve）
C. 舌咽神經（glossopharyngeal nerve）
D. 第八顱神經

正確答案：C. 舌咽神經（glossopharyngeal nerve）